一位 70 歲婦女因肺出血及血尿住院，病人過去有類風濕性關節炎（RA）及高血壓並接受治療，住院期間發現腎功能急速惡化，肺部穿刺檢查結果為壞死性血管炎（necrotizing vasculitis），下列何種檢查對病人之病因有特殊之診斷結果？
A. 紅血球沉降速度（ESR）
B. C-反應蛋白（CRP）
C. 抗中性白血球細胞質抗體（ANCA）
D. 補體（complement）

正確答案：C. 抗中性白血球細胞質抗體（ANCA）